Clinical trial inclusion criterion:
Pregnant patients who require a scheduled or non-urgent cesarean birth

Entity relations:
- Has_qualifier("cesarean birth", "scheduled")
- OR("scheduled", "non-urgent")